一位原本正常且無特別過去病史的 3 歲男孩因 5 分鐘前突發性全身抽搐緊急送至急診後，當時體溫為 39℃，心跳為 120／分鐘而血壓正常，但是有明顯嘴唇發黑、意識喪失、兩眼上吊及手腳僵直。 在急診第一優先且重要的醫療處置是：
A. 施打 anticonvulsant
B. 給予氣管插管，接上呼吸器改善缺氧狀況
C. 實施全面性神經理學檢查
D. 維持呼吸道通暢以利甦醒後呼吸

正確答案：D. 維持呼吸道通暢以利甦醒後呼吸